Hematologic laboratory values as outlined in the protocol

The above is a clinical trial inclusion criterion. Annotated with entity spans:
[Non-representable: Hematologic laboratory values as outlined in the protocol]